Clinical trial exclusion criterion:
Allergic reaction upon erythropoietin

Entity relations:
- AND("Allergic", "erythropoietin")